Clinical trial inclusion criteria:
Age 18-65
scheduled to receive ISB and general anesthesia as a day surgery patient for rotator cuff repair and acromioplasty, as a part of planned routine care

Annotated entities:
- Person: "Age"
- Value: "18-65"
- Procedure: "rotator cuff repair"
- Procedure: "acromioplasty"
- Qualifier: "day surgery"
- Procedure: "ISB"
- Procedure: "general anesthesia"